Clinical trial exclusion criterion:
10. Known immunodeficiency or HIV, Hepatitis B or Hepatitis C positivity.

Annotated entities:
- Parsing_Error: "10."
- Condition: "immunodeficiency"
- Condition: "HIV"
- Condition: "Hepatitis B"
- Condition: "Hepatitis C"